¿En qué modalidad cromatográfica se utiliza la columna supresora?
1. Cromatografía de partición.
2. Cromatografía iónica.
3. Cromatografía de exclusión por tamaños.
4. Cromatografía de afinidad.

Respuesta correcta: 2. Cromatografía iónica.